Clinical trial inclusion criterion:
Type 1 or 2 diabetes

Entity relations:
- OR("Type 2 diabetes", "Type 1 diabetes")